Clinical trial exclusion criterion:
Treatment with oral contraceptives (unless a second form of birth control is used and documented)

Entity relations:
- AND("Treatment", "oral contraceptives")
- Has_qualifier("birth control", "second form")
- Has_negation("birth control", "unless")
- Has_context("Treatment", "birth control")